What are Drosophila's balancer chromosomes?

genetic reagents